Clinical trial inclusion criterion:
2. ST elevation in 2 contiguous ECG leads (= 2 mm precordial lead, = 1 mm limb lead). This ECG recording serves as baseline ECG, i.e. ECG I.

Annotated entities:
- Condition: "ST elevation"
- Measurement: "precordial lead"
- Measurement: "limb lead"
- Value: "1 mm"
- Value: "2 mm"
- Measurement: "contiguous ECG leads"
- Value: "2"